Age 18 years or above

The above is a clinical trial inclusion criterion. Annotated with entity spans:
[Person: Age] [Value: 18 years or above]